Where is the histone variant CENPA preferentially localized?

THe histone variant CENPA is preferentially located at Centromeric chromatin